Clinical trial exclusion criterion:
Severe hepatic impairment

Annotated entities:
- Condition: "hepatic impairment"
- Qualifier: "Severe"